Clinical trial inclusion criterion:
Patient has an active pathological bleeding, such as active gastrointestinal (GI) bleeding

Entity relations:
- Has_qualifier("pathological bleeding", "active")
- Has_qualifier("gastrointestinal (GI) bleeding", "active")
- Subsumes("pathological bleeding", "gastrointestinal (GI) bleeding")